Clinical trial inclusion criterion:
4. Patients with CRPS must have met current IASP (International Association for the Study of Pain) diagnostic criteria

Entity relations:
- Has_value("IASP (International Association for the Study of Pain) diagnostic criteria", "met")